Clinical trial exclusion criterion:
Incarceration

Annotated entities:
- Person: "Incarceration"